Clinical trial inclusion criterion:
4. Has an upper arm circumference which is adequate for proper fit of the EMG monitor (at least 14cm).

Annotated entities:
- Parsing_Error: "4."
- Measurement: "upper arm circumference"
- Qualifier: "adequate for proper fit of the EMG monitor"
- Undefined_semantics: "adequate for proper fit of the EMG monitor"
- Value: "at least 14cm"